Clinical trial exclusion criterion:
if Hepatic disease is present

Annotated entities:
- Condition: "Hepatic disease"